Clinical trial exclusion criterion:
Four weeks or less since completion of treatment using an investigational product/device in another clinical study or presence of any unresolved toxicity from previous treatment

Entity relations:
- AND("completion of treatment", "treatment")
- Has_index("Four weeks or less since completion of treatment", "completion of treatment")
- Has_qualifier("toxicity", "unresolved")
- Has_temporal("treatment", "previous")
- AND("toxicity", "treatment")
- Has_temporal("investigational product", "Four weeks or less since completion of treatment")
- AND("investigational product", "another clinical study")
- OR("investigational product", "investigational device")
- OR("investigational product", "toxicity")